Clinical trial exclusion criterion:
Previous treatment with romiplostim or eltrombopag

Annotated entities:
- Drug: "romiplostim"
- Drug: "eltrombopag"